Clinical trial inclusion criterion:
Westley croup score between 3 and 11

Annotated entities:
- Measurement: "Westley croup score"
- Value: "between 3 and 11"